(3)Voluntarily continues to participate in this study.

The above is a clinical trial inclusion criterion. Annotated with entity spans:
(3)[Qualifier: Voluntarily] [Observation: continues to participate in this study].